Clinical trial exclusion criterion:
History of seizures

Entity relations:
- Has_temporal("seizures", "History of")